Clinical trial inclusion criterion:
Wheezing

Annotated entities:
- Condition: "Wheezing"